What is the effect of CRD-BP on the stability of c-myc mRNA?

The coding region determinant-binding protein (CRD-BP) binds in vitro to c-myc mRNA and is thought to stabilize the mRNA and increase c-Myc protein abundance